Clinical trial inclusion criterion:
anyone not excluded and consenting

Annotated entities:
- Post-eligibility: "anyone not excluded and consenting"